有一位 60 歲男性病人以前有 30 年之吸菸史，胸部 X 光檢查發現有肺氣腫，病人稍一走路即有呼吸急促現象，雖經氣管擴張劑治療，但病況仍逐漸惡化，經轉介作肺減容手術（lung volume reduction surgery），其檢查結果中下列何者判為不適宜作此種手術？
A. 平均肺動脈壓為 30 mmHg
B. 胸部電腦斷層檢查發現兩肺上葉氣腫病變較嚴重
C. 呼吸功能檢查 FEV1.0 為預測值之 30%
D. 動脈血氧分析之 PaCO2 為 65 mmHg

正確答案：D. 動脈血氧分析之 PaCO2 為 65 mmHg